Atrio-ventricular conduction disturbances

The above is a clinical trial exclusion criterion. Annotated with entity spans:
[Condition: Atrio-ventricular conduction disturbances]